Congenital adrenal hyperplasia (17-OH-progesterone> 2.5 ng / mL)

The above is a clinical trial exclusion criterion. Annotated with entity spans:
[Condition: Congenital adrenal hyperplasia] ([Measurement: 17-OH-progesterone][Value: > 2.5 ng / mL])